下列那一個神經遺傳性疾病不會合併有棘紅血球（acanthocyte）？
A. Wilson disease
B. abetalipoproteinemia
C. McLeod syndrome
D. Hallervorden-Spatz disease

正確答案：A. Wilson disease